Clinical trial exclusion criterion:
Another obvious severe disease explaining insomnia

Entity relations:
- AND("severe disease", "insomnia")